Use of topical or systemic drug products classified as forbidden

The above is a clinical trial exclusion criterion. Annotated with entity spans:
[Non-representable: Use of topical or systemic drug products classified as forbidden]